Clinical trial exclusion criterion:
3. Persistent pulmonary hypertension of the newborn

Entity relations:
- Has_qualifier("pulmonary hypertension of the newborn", "Persistent")